Which tool has been developed for prediction of single-cell DNA methylation states using deep learning?

DeepCpG is a computational approach based on deep neural networks to predict single-cell DNA methylation states in single cells.